高血鈣急症的治療原則下列那一項最不適當？
A. 立即補充生理食鹽水
B. 使用thiazide類利尿劑
C. 惡性腫瘤引發高血鈣可以考慮給予雙磷酸鹽（bisphosphonates）
D. 維生素D造成的高血鈣症可以考慮使用類固醇治療

正確答案：B. 使用thiazide類利尿劑